Clinical trial exclusion criterion:
Subjects who have ever received treatment with biological based therapy example, omalizumab, mepolizumab, for asthma.

Annotated entities:
- Procedure: "treatment"
- Drug: "omalizumab"
- Drug: "mepolizumab"
- Drug: "asthma"